Clinical trial exclusion criterion:
any type of steroid in regular use

Annotated entities:
- Drug: "steroid"
- Multiplier: "regular use"